Clinical trial exclusion criterion:
Psychotic symptoms occurring at any time during the current major depressive episode.

Annotated entities:
- Condition: "Psychotic symptoms"
- Condition: "major depressive episode"
- Temporal: "at any time during the current major depressive episode"
- Reference_point: "the current major depressive episode"
- Temporal: "current"